En el ADN las secuencias de 10 a 60 nucleótidos repetidas en tándem se denominan:
1. Pseudogenes.
2. LINES.
3. SINES.
4. Microsatélites.
5. Minisatélites.

Respuesta correcta: 5. Minisatélites.